Clinical trial exclusion criterion:
Known hypersensitivity to statin

Entity relations:
- AND("hypersensitivity", "statin")